Clinical trial inclusion criterion:
ASA physical status classification I or II

Annotated entities:
- Measurement: "ASA physical status classification"
- Value: "I or II"